Clinical trial exclusion criterion:
Inability to attend scheduled clinic visits and/or comply with the study protocol.

Annotated entities:
- Post-eligibility: "Inability to attend scheduled clinic visits and/or comply with the study protocol."